Lack of capacity or willingness to consent

The above is a clinical trial exclusion criterion. Annotated with entity spans:
[Negation: Lack of] [Observation: capacity] or [Observation: willingness to consent]